Clinical trial inclusion criterion:
Agree to be washed-out for two weeks if receiving SSRI, SNRI or NASA.

Annotated entities:
- Procedure: "SSRI"
- Procedure: "SNRI"
- Procedure: "NASA"
- Temporal: "for two weeks"
- Procedure: "washed-out"